林先生為鼻咽癌症末期病人，因呼吸困難被家人送到醫院急診室，林先生意識不清，醫護人員認為病患死亡已無法避免，不應予以急救，下列作法的優先次序為何？①詢問有無本人之 DNR意願書 ②解釋、徵求家屬的同意並簽署同意書 ③詢問是否有醫療委任代理人
A. ①→③→②
B. ①→②→③
C. ②→①→③
D. ③→①→②

正確答案：A. ①→③→②